Ulcers older than 1 year.

The above is a clinical trial exclusion criterion. Annotated with entity spans:
[Condition: Ulcers] [Temporal: older than 1 year].